Subjects who are known, current alcohol and/or drug abusers

The above is a clinical trial exclusion criterion. Annotated with entity spans:
Subjects who are known, current [Person: alcohol] and/or [Person: drug abusers]